Clinical trial exclusion criterion:
Patients with bladder outlet obstruction (BOO) that, in the opinion of the study urologist, would expose them to risk of urinary retention during treatment with mirabegron.

Entity relations:
- Subsumes("bladder outlet obstruction", "BOO")
- Has_context("bladder outlet obstruction", "risk of urinary retention")